Which is the most common monogenic cause of common variable immunodeficiency (CVID) in Europeans?

Heterozygous loss-of-function variants in NFKB1 are the most common known monogenic cause of common variable immunodeficiency (CVID), which results in a temporally progressive defect in the formation of immunoglobulin-producing B cells